Clinical trial inclusion criterion:
4. Has WHO/NYHA-FC of II or III.

Annotated entities:
- Parsing_Error: "4."
- Measurement: "WHO/NYHA-FC"
- Value: "II"
- Value: "III"